Clinical trial exclusion criterion:
past esophageal, gastric or bariatric surgery

Entity relations:
- OR("esophageal surgery", "gastric surgery", "bariatric surgery")